Clinical trial exclusion criterion:
who are judged by the investigator to should be excluded from the study

Annotated entities:
- Observation: "judged by the investigator to should be excluded from the study"